El mecanismo por el que transcurre la reacción de clorobenceno con amiduro de sodio en amoniaco líquido para dar lugar a anilina, después de la hidrólisis, es:
1. Sustitución nucleófila unimolecular.
2. Sustitución nucleófila bimolecular.
3. Adición-Eliminación.
4. Eliminación-Adición.

Respuesta correcta: 4. Eliminación-Adición.